Clinical trial exclusion criterion:
Presence of any Axis I psychiatric disorder (other than unipolar major depression) or substance abuse;

Annotated entities:
- Condition: "psychiatric disorder"
- Qualifier: "Axis I"
- Negation: "other than"
- Condition: "unipolar major depression"
- Condition: "substance abuse"